The pregnant or lactating woman

The above is a clinical trial exclusion criterion. Annotated with entity spans:
The [Condition: pregnant] or [Condition: lactating] [Person: woman]